Clinical trial inclusion criteria:
Diagnosis of schizophrenia or schizoaffective disorder
If entering the study as an inpatient, hospitalization was recent
Currently receiving treatment with an atypical antipsychotic and continuation on the medication has been recommended
Assumes primary responsibility for taking medication
Currently living in a stable environment

Annotated entities:
- Condition: "schizophrenia"
- Condition: "schizoaffective disorder"
- Visit: "inpatient"
- Visit: "hospitalization"
- Temporal: "recent"
- Drug: "atypical antipsychotic"
- Temporal: "Currently"
- Procedure: "treatment"
- Procedure: "continuation on the medication"
- Mood: "recommended"
- Non-query-able: "Assumes primary responsibility for taking medication"
- Observation: "living in a stable environment"